有關女性假陰陽人（female pseudohermaphroditism）具有特徵之敘述，下列何者錯誤？
A. 男性荷爾蒙分泌太多
B. 染色體46, XX
C. 肇因於腎上腺萎縮
D. 外生殖器官男性化

正確答案：C. 肇因於腎上腺萎縮